Which disease is PGT121 used for?

The broadly neutrilizing antibody PGT121 is being tested against HIV-1.